Age > 18 years

The above is a clinical trial inclusion criterion. Annotated with entity spans:
[Person: Age] [Value: > 18 years]